undergoing elective tonsillectomy with or without adenoidectomy

The above is a clinical trial inclusion criterion. Annotated with entity spans:
undergoing [Qualifier: elective] [Condition: tonsillectomy] with or without [Condition: adenoidectomy]